下列有關腕隧道症候群（carpal tunnel syndrome）之敘述，何者錯誤？
A. 曲腕動作會加重症狀
B. 一定有魚際肌（thenar muscle）的萎縮
C. 初期可以施用副木治療
D. 手術是切斷腕橫韌帶（transverse carpal ligament）

正確答案：B. 一定有魚際肌（thenar muscle）的萎縮